Patients who have coma, convulsion or paralysis due to intracranial hemorrhage or central nervous system leukemia at diagnosis.

The above is a clinical trial exclusion criterion. Annotated with entity spans:
Patients who have [Condition: coma], [Condition: convulsion] or [Condition: paralysis] due to [Condition: intracranial hemorrhage] or [Qualifier: central nervous system] [Condition: leukemia] [Temporal: at diagnosis].